Clinical trial exclusion criterion:
Antibiotic prophylaxis within the last 6 months

Annotated entities:
- Procedure: "Antibiotic prophylaxis"
- Temporal: "within the last 6 months"
- Drug: "Antibiotic"